Those less than 18 years of age.

The above is a clinical trial exclusion criterion. Annotated with entity spans:
Those [Value: less than 18 years] of [Person: age].